Clinical trial inclusion criterion:
regular bowel care routine (at least four weeks)

Annotated entities:
- Observation: "regular bowel care routine"
- Temporal: "at least four weeks"